Respecto a la toma de decisiones al final de la vida señale la respuesta INCORRECTA:
1. La negativa a intervenciones para conservar la vida del paciente puede considerarse suicidio o incluso asesinato.
2. La administración de antibióticos o la infusión de suero debe evitarse en estas situaciones.
3. Deben suspenderse aquellas actividades que se demuestren que no son útiles para el paciente.
4. Los médicos son los responsables de firmar la orden de no reanimación explicando los motivos.

Respuesta correcta: 1. La negativa a intervenciones para conservar la vida del paciente puede considerarse suicidio o incluso asesinato.